El esqueleto carbonado de la prolina se convierte durante su catabolismo, total o parcialmente, en:
1. Acetil-CoA.
2. Acetoacetil-CoA.
3. α-Cetoglutarato.
4. Fumarato.

Respuesta correcta: 3. α-Cetoglutarato.